Clinical trial inclusion criterion:
Irritable Bowel Syndrome (IBS) (ROME III criteria): subtype with diarrhea or mixed form

Entity relations:
- Has_qualifier("Irritable Bowel Syndrome (IBS)", "ROME III criteria")
- AND("Irritable Bowel Syndrome (IBS)", "diarrhea")
- OR("diarrhea", "mixed form")